Which RNA polymerase II subunit carries RNA cleavage activity?

In contrast, Pol II is fully protected through association with the cleavage stimulatory factor TFIIS, which enables rapid recovery from any depth by RNA cleavage.